大部分食物的消化與吸收發生在下列何處？
A. 胃
B. 小腸
C. 大腸
D. 直腸

正確答案：B. 小腸